Clinical trial inclusion criterion:
HIV negative

Entity relations:
- Has_value("HIV", "negative")